Patients with intestinal pathology or severe diarrhea that may decrease absorption according to medical criteria.

The above is a clinical trial exclusion criterion. Annotated with entity spans:
Patients with [Condition: intestinal pathology] or [Condition: severe diarrhea] that [Observation: may decrease absorption] according to medical criteria.